Which intraflagellar transport (IFT) motor protein has been linked to human skeletal ciliopathies?

Cytoplasmic dynein-2 (dynein-2) performs intraflagellar transport and is associated with human skeletal ciliopathies